Clinical trial inclusion criterion:
Hemodynamically stable and appropriate for induction of labor as per primary clinical health team in house

Annotated entities:
- Condition: "Hemodynamically stable"
- Procedure: "induction of labor"